SVD defined on echocardiography by an alteration of bioprosthesis leaflets function with a mean transvalvular gradient > 20 mmHg and maximal velocity = 3 m/s and effective orifice area =1.2 cm², and/or an aortic regurgitation more or equal to grade 2 on 4.

The above is a clinical trial inclusion criterion. Annotated with entity spans:
[Condition: SVD] defined on [Procedure: echocardiography] by an [Condition: alteration of bioprosthesis leaflets function] with a [Measurement: mean transvalvular gradient] [Value: > 20 mmHg] and [Measurement: maximal velocity] [Value: = 3 m/s] and [Measurement: effective orifice area] [Value: =1.2 cm²], and/or an [Condition: aortic regurgitation] [Value: more or equal to] [Measurement: grade] 2 on 4.